Which disease risk can be estimated with the Stop-Bang questionnaire?

Stop-Bang questionnaire is used to predict risk of obstructive sleep apnea (OSA).